Clinical trial exclusion criterion:
Allergic reactions against fish or egg proteins

Annotated entities:
- Drug: "fish proteins"
- Drug: "egg proteins"
- Condition: "Allergic reactions"